Preoperative Hemoglobin <U+2266>11 g/dl

The above is a clinical trial exclusion criterion. Annotated with entity spans:
[Temporal: Preoperative] [Measurement: Hemoglobin] [Value: <U+2266>11 g/dl]